關於周全性老年評估，下列敘述何者錯誤？
A. 是在了解虛弱老人之問題，進而提供整體計畫，以作為治療及長期追蹤之參考
B. 執行流程包括篩檢適合的病人、評估、建議及執行
C. 可適用於各層級的老人照護
D. 是以身體疾病的篩檢為主

正確答案：D. 是以身體疾病的篩檢為主